What is the effect of grapefruit juice on CYP3A4?

Grapefruit juice inhibits CYP3A4 activity.